Clinical trial inclusion criterion:
Patient informed of the preliminary medical exam results

Annotated entities:
- Post-eligibility: "Patient informed of the preliminary medical exam results"